Al valorar la postura que mantiene el bebe mamando, ¿cuál de los siguientes signos indican que NO es correcta la posición y agarre del bebe al pecho?
1. El mentón toca el pecho.
2. La boca está muy abierta.
3. Labios evertidos.
4. Nariz muy pegada al pecho.
5. Más areola visible por encima de la boca.

Respuesta correcta: 4. Nariz muy pegada al pecho.